Clinical trial exclusion criterion:
Resistant hypertension, defined as BP > 140/90, despite the use of three or more anti-hypertensive drugs

Entity relations:
- Has_value("BP", "> 140/90")
- Subsumes("Resistant", "BP")
- Has_qualifier("hypertension", "Resistant")
- Has_multiplier("anti-hypertensive drugs", "three or more")
- Has_qualifier("Resistant", "despite the use of three or more anti-hypertensive drugs")